Describe the INSPEcT R package

INSPEcT is an R package for the integrative analysis of RNA- and 4sU-seq data to study the dynamics of transcriptional regulation. To graphically inspect the resulting networks, the package contains a visualization tool, which allows for the direct network manipulation and access of node and link information. INSPecT-GUI is freely available within the R/Bioconductor package INSPECT at http://bioconductor.org/packages/INSPECAT/.